關於奴卡氏菌屬（Nocardia species）之敘述，下列何者正確？
A. 為革蘭氏陰性桿菌
B. 較少引起肺部及皮膚感染
C. 為細胞壁含黴菌酸（mycolic acid）之需氧菌
D. 不會產生索狀因子（cord factor）

正確答案：C. 為細胞壁含黴菌酸（mycolic acid）之需氧菌